Which drugs used in the treatment of Systemic Lupus Erythematosus are targeting granulocytes?

Systems responded to rituximab and cyclophosphamide.